Clinical trial inclusion criteria:
Recipient is Age = 18 years
Serum ALT within normal limits with no history of liver disease
Lack of sensitization (i.e. PRA < 20%) that would be expected to result in a high likelihood of needing aggressive immunosuppression to treat rejection

Annotated entities:
- Person: "Age"
- Value: "= 18 years"
- Measurement: "Serum ALT"
- Value: "within normal limits"
- Negation: "no"
- Temporal: "history"
- Condition: "liver disease"
- Negation: "Lack of"
- Condition: "sensitization"
- Measurement: "PRA"
- Value: "< 20%"
- Non-representable: "that would be expected to result in a high likelihood of needing aggressive immunosuppression to treat rejection"